What is the difference between the nuclease Cas13a and C2c2

Cas13a was previously called C2c2.